La hoja plegada β:
1. Está formada por una sola cadena polipetídica.
2. Presenta una distancia entre aminoácidos adyacentes de aproximadamente 4 ångströms.
3. Se forma por la unión de dos o más hebras mediante puentes de hidrógeno.
4. Presenta las cadenas laterales de aminoácidos contiguos apuntando hacia el mismo lado.
5. Son de dos tipos: paralela, donde las cadenas de la hoja β van en distinto sentido y antiparalela, donde van en el mismo sentido.

Respuesta correcta: 3. Se forma por la unión de dos o más hebras mediante puentes de hidrógeno.